Clinical trial exclusion criterion:
Pregnancy or childbearing potential without adequate contraception

Entity relations:
- Has_qualifier("contraception", "adequate")
- Has_negation("contraception", "without")
- OR("Pregnancy", "childbearing potential")